Clinical trial inclusion criterion:
TLC > 120% predicted, RV > 150% predicted.

Entity relations:
- Has_value("RV", "> 150% predicted")
- Has_value("TLC", "> 120% predicted")